Clinical trial exclusion criterion:
contra indication to dexamethasone

Annotated entities:
- Drug: "dexamethasone"
- Condition: "contra indication"